Clinical trial exclusion criterion:
Be judged not suitable to participate the study by the investigators

Annotated entities:
- Non-query-able: "Be judged not suitable to participate the study by the investigators"